下列那一項目前不建議作為老人癌症篩檢的項目？
A. 乳房攝影：乳癌
B. 子宮頸抹片：子宮頸癌
C. 糞便潛血檢查：大腸癌
D. 婦科超音波：卵巢癌

正確答案：D. 婦科超音波：卵巢癌